4. Known elevated liver enzymes in past clinical trials with any compound (experimental or marketed)

The above is a clinical trial exclusion criterion. Annotated with entity spans:
[Parsing_Error: 4.] [Context_Error: Known elevated liver enzymes in past clinical trials with any compound (experimental or marketed)]